頭部外傷病人先有短暫意識喪失，然後有一段清醒之清明期（lucid interval），接著陷入深度昏迷，此種臨床表現最有可能為何種出血狀態的典型表現？
A. 硬膜上出血（epidural hemorrhage）
B. 硬膜下出血（subdural hemorrhage）
C. 蜘蛛膜下腔出血（subarachnoid hemorrhage）
D. 大腦鐮（cerebral falx）出血

正確答案：A. 硬膜上出血（epidural hemorrhage）